有關肛門的 Bowen 氏病（Bowen's disease）之敘述，下列何者錯誤？
A. 它是一種很少轉移的原位腺癌
B. 大多數病人的症狀輕微或無任何症狀
C. 局部的廣泛性切除常可達到治癒的效果
D. 手術中的冷凍切片對切除範圍的決定有幫忙

正確答案：A. 它是一種很少轉移的原位腺癌